Clinical trial exclusion criterion:
surgical interventions for PD;

Annotated entities:
- Procedure: "surgical interventions for PD"
- Condition: "PD"